有關外用pimecrolimus及tacrolimus的敘述，下列何者錯誤？
A. 可以用來治療異位性皮膚炎（atopic dermatitis）
B. 容易引起皮膚萎縮的副作用
C. 是一種calcineurin inhibitor
D. 會抑制T cell的活化

正確答案：B. 容易引起皮膚萎縮的副作用